29 歲女性患者，性格內向、拘謹、做事仔細、認真。3 個月前出現反覆回憶過去做過的事，反覆檢查辦公室抽屜鎖是否關好，對家裡的煤氣開關也要反覆檢查。看見利器則不斷擔心自己是否會 傷害家人，明知這種想法不合理，卻又無法自控，為此感到苦惱。本案例最可能的診斷是：
A. 恐懼症
B. 強迫症
C. 失憶症
D. 人格障礙

正確答案：B. 強迫症